Clinical visual evidence of candidiasis at Visit 1 (Screening).

The above is a clinical trial exclusion criterion. Annotated with entity spans:
Clinical [Condition: visual evidence] of [Condition: candidiasis] [Temporal: at Visit 1 (Screening)].